下列何者所接收的訊息，是由前庭神經下分支（inferior division of vestibular nerve）傳入中樞？
A. 上半規管（superior semicircular canal）
B. 側半規管（lateral semicircular canal）
C. 後半規管（posterior semicircular canal）
D. 橢圓囊（utricle）

正確答案：C. 後半規管（posterior semicircular canal）